Paciente     de      79      años,   hipertenso, hiperlipidémico, diabético y con EPOC en tratamiento con anticolinérgicos inhalados. Presenta fibrilación auricular crónica en tratamiento anticoagulante con dicumarínicos. Tras un cuadro de 3 días de tos, expectoración amarilla y fiebre de 38ºC, presenta en las últimas 24 h empeoramiento progresivo con disnea de esfuerzo, ortopnea y edemas maleolares. A la exploración destaca una TA de 170/95     mmHg,      disnea    con   frecuencia respiratoria de 20 rpm y auscultación con sibilancias bilaterales y crepitantes en bases. Taquiarritmia a 110 lpm. Discretos edemas maleolares. ¿Cuál es el planteamiento a seguir?
1. El paciente probablemente presente una neumonía y lo prioritario es realizar una Rx de torax para confirmarlo.
2. Probablemente se trate de una agudización de su EPOC debido a una sobreinfección respiratoria. Reforzar el tratamiento de base con un beta-2 inhalado, corticoides y antibióticos y vigilar evolución.
3. Es probable que tenga un componente de insuficiencia cardiaca izquierda asociada a una infección respiratoria febril. Sería prioritario el tratarlo con vasodilatadores y diuréticos además del tratamiento que corresponda a su infección respiratoria, broncodilatadores, etc.
4. El paciente no está clasificado de la gravedad de su EPOC por lo que indicaría una espirometría inmediata para ajustar el tratamiento a la gravedad de la obstrucción. Asociaría además un antibiótico dado el cuadro      aparente     de     sobreinfección respiratoria.
5. Un ecocardiograma sería la primera exploración a realizar para descartar un posible componente de insuficiencia cardiaca asociado al cuadro de EPOC agudizado que presenta el paciente.

Respuesta correcta: 3. Es probable que tenga un componente de insuficiencia cardiaca izquierda asociada a una infección respiratoria febril. Sería prioritario el tratarlo con vasodilatadores y diuréticos además del tratamiento que corresponda a su infección respiratoria, broncodilatadores, etc.